Clinical trial exclusion criterion:
Dementia - diagnosed and/or MoCA score <18

Entity relations:
- Has_value("MoCA score", "<18")
- AND("Dementia", "MoCA score")